Clinical trial exclusion criterion:
occasional use of pipes is permitted if subject abstains for the week prior to the study

Annotated entities:
- Non-query-able: "ccasional use of pipes is permitted if subject abstains for the week prior to the study"